Clinical trial exclusion criterion:
Regular use of narcotic analgesics (>2 doses per week).

Annotated entities:
- Drug: "narcotic analgesics"
- Multiplier: ">2 doses per week"
- Multiplier: "Regular use"